Clinical trial inclusion criterion:
Collection of written informed consent (legal obligation for any project under the public health law , bioethics laws and / or CNIL) .

Annotated entities:
- Non-query-able: "Collection of written informed consent (legal obligation for any project under the public health law , bioethics laws and / or CNIL) ."